Clinical trial exclusion criterion:
Known or suspected gram-negative infections, anaerobic infections, or fungemia

Entity relations:
- Has_qualifier("infections", "gram-negative")
- Has_qualifier("infections", "anaerobic")
- OR("infections", "infections", "fungemia")